In which cellular compartment do stress granules localize?

Stress granules (SGs) are cytoplasmic granules that are formed in cells when stress occurs.